Age: ≥18 and ≤ 60

The above is a clinical trial inclusion criterion. Annotated with entity spans:
[Person: Age]: [Value: ≥18 and ≤ 60]